Screening tool: TMS adult safety questionnaire, Medical History.

The above is a clinical trial exclusion criterion. Annotated with entity spans:
[Procedure: Screening] tool: [Procedure: TMS adult safety questionnaire], [Temporal: Medical History].